contraindication against metamizole known or suspected (known or suspected allergy against novalgin or other pyrazolones, anaphylactic reaction against NSAIDS, decreased bone marrow function or hematopoesis, hepatic porphyria, glucose-6-phosphate dehydrogenase deficiency, and pregnancy/breastfeeding)

The above is a clinical trial exclusion criterion. Annotated with entity spans:
[Condition: contraindication] against [Drug: metamizole] [Qualifier: known] or [Qualifier: suspected] ([Qualifier: known] or [Qualifier: suspected] [Condition: allergy] against [Drug: novalgin] or [Qualifier: other] [Drug: pyrazolones], [Condition: anaphylactic reaction] against [Drug: NSAIDS], [Value: decreased] [Measurement: bone marrow function] or [Measurement: hematopoesis], [Condition: hepatic porphyria], [Condition: glucose-6-phosphate dehydrogenase deficiency], and [Condition: pregnancy]/[Observation: breastfeeding])